Clinical trial exclusion criterion:
upper respiratory tract infection

Annotated entities:
- Condition: "upper respiratory tract infection"